Clinical trial inclusion criterion:
1. Male or female, 18-75 years old.

Entity relations:
- Has_value("years old", "18-75 years")
- OR("Male", "female")